Histologically confirmed primary breast cancer

The above is a clinical trial inclusion criterion. Annotated with entity spans:
[Qualifier: Histologically confirmed] [Condition: primary breast cancer]